Patients using chronic oral neuromodulators

The above is a clinical trial exclusion criterion. Annotated with entity spans:
Patients using [Drug: chronic oral neuromodulators]